Clinical trial exclusion criterion:
clinically significant ECG

Entity relations:
- Has_qualifier("ECG", "clinically significant")